Clinical trial exclusion criterion:
Compromised neurologic status on exam (specifically assessment of radial, ulnar, and median nerve)

Annotated entities:
- Condition: "Compromised neurologic status"
- Qualifier: "nerve radial"
- Qualifier: "nerve ulnar"
- Qualifier: "median nerve"